HBeAg negative within six months prior to initiation of peginterferon alfa-2a

The above is a clinical trial inclusion criterion. Annotated with entity spans:
[Measurement: HBeAg] [Value: negative] [Temporal: within six months prior to initiation of peginterferon alfa-2a]